Clinical trial inclusion criterion:
5) ability to walk without assistance and without an AFO on the treadmill ≥ 30 seconds at speeds ranging from 0.2-0.8 m/s,

Annotated entities:
- Condition: "ability to walk without assistance"
- Measurement: "AFO on the treadmill"
- Value: "≥ 30 seconds"
- Negation: "without"
- Qualifier: "speeds"
- Value: "from 0.2-0.8 m/s"
- Parsing_Error: "5)"